biologic therapy (e.g., bevacizumab) as part of their primary treatment regimen or part of their treatment for management of recurrent or persistent disease.

The above is a clinical trial inclusion criterion. Annotated with entity spans:
[Procedure: biologic therapy] (e.g., [Drug: bevacizumab]) as part of their [Procedure: primary treatment regimen] or part of their [Procedure: treatment] for management of [Context_Error: recurrent or persistent disease].